Clinical trial exclusion criterion:
previous intubation or apnea history

Entity relations:
- Has_temporal("intubation", "previous")
- Has_temporal("intubation", "history")
- OR("intubation", "apnea")